Coagulation disturbances not normalized by medical treatment

The above is a clinical trial exclusion criterion. Annotated with entity spans:
[Condition: Coagulation disturbances] [Negation: not] [Qualifier: normalized] by [Procedure: medical treatment]